下列那一序列會調控真核 mRNA 進行核內 polyadenylation？
A. UUAUUU
B. UUUUUAU
C. UAUUUUU
D. AAUAAA

正確答案：D. AAUAAA